Congestive Heart Failure (CHF)

The above is a clinical trial exclusion criterion. Annotated with entity spans:
[Condition: Congestive Heart Failure (CHF)]